因食物而發生的疾病（foodborne diseases）有食物中毒（food poisoning）和因食物而發生的感染   （foodborne infections）。在國內食物中毒的案例中，最常發生的是因為：
A. 葡萄球菌（Staphylococci）引起的
B. 河豚引起的
C. 重金屬污染引起的
D. 隱孢子蟲引起的

正確答案：A. 葡萄球菌（Staphylococci）引起的